Clinical trial inclusion criterion:
Able to give informed consent

Annotated entities:
- Observation: "Able to give informed consent"